open abdominal surgeries except simple appendectomy and common OB/GYN procedures in the pelvis (hysterectomy, C-section, and oophorectomy, tubal ligation)

The above is a clinical trial exclusion criterion. Annotated with entity spans:
[Procedure: open abdominal surgeries] [Negation: except] [Procedure: simple appendectomy] and [Procedure: common OB/GYN procedures] in the [Qualifier: pelvis] ([Procedure: hysterectomy], [Procedure: C-section], and [Procedure: oophorectomy], [Procedure: tubal ligation])